Clinical trial exclusion criterion:
Severe liver disease

Entity relations:
- Has_qualifier("liver disease", "Severe")